Clinical trial exclusion criterion:
Any active respiratory, cardiovascular or other disease requiring regular treatment or being otherwise relevant for tolerance of hypoxia or altitude exposure.

Annotated entities:
- Condition: "respiratory disease"
- Condition: "cardiovascular disease"
- Condition: "disease"
- Qualifier: "other"
- Qualifier: "active"
- Procedure: "treatment"
- Qualifier: "regular"
- Condition: "tolerance"
- Condition: "hypoxia"
- Mood: "relevant for"
- Observation: "altitude exposure"